Clinical trial exclusion criteria:
Molar teeth
Milller Class 4 recession defects
Pregnancy (Self-reported)
Smoking
Uncontrolled local or systemic diseases that affects wound healing (diabetes, autoimmune or inflammatory disorders)
Past history of systemic steroid use over 2 weeks within the last 2 years
Poor oral hygiene on a non-compliant individual
Ibuprofen Allergy/interlerance
Anticoagulant therapy (e.g. Warfarin, Plavix, etc.), will not be automatic exclusion but patients will be required to have INR test performed and have values between 2.0 to 3. Physician consultation will be requested to determine whether anticoagulant therapy can be discontinued for 3 days prior to surgery.
Objection to blood draw or application of blood products
Students and staff from USC Ostrow school of Dentistry will not be recruited for this study

Annotated entities:
- Condition: "Molar teeth"
- Measurement: "Milller"
- Value: "Class 4"
- Condition: "recession defects"
- Condition: "Pregnancy"
- Non-query-able: "Self-reported"
- Condition: "Smoking"
- Condition: "diseases local"
- Condition: "systemic diseases"
- Qualifier: "Uncontrolled"
- Qualifier: "that affects wound healing"
- Condition: "diabetes"
- Condition: "autoimmune disorders"
- Condition: "inflammatory disorders"
- Temporal: "Past history"
- Drug: "systemic steroid"
- Temporal: "over 2 weeks"
- Temporal: "within the last 2 years"
- Condition: "Poor oral hygiene"
- Observation: "non-compliant"
- Non-query-able: "non-compliant"
- Drug: "Ibuprofen"
- Condition: "Allergy"
- Condition: "interlerance"
- Procedure: "Anticoagulant therapy"
- Drug: "Warfarin"
- Drug: "Plavix"
- Grammar_Error: "will not be automatic exclusion"
- Measurement: "INR test"
- Value: "between 2.0 to 3"
- Procedure: "anticoagulant therapy"
- Not_a_criteria: "Physician consultation will be requested to determine whether anticoagulant therapy can be discontinued for 3 days prior to surgery."
- Non-query-able: "Physician consultation will be requested to determine whether anticoagulant therapy can be discontinued for 3 days prior to surgery."
- Non-query-able: "Objection to blood draw or application of blood products"
- Non-query-able: "Students and staff from USC Ostrow school of Dentistry will not be recruited for this study"